下列關於電子傳遞鏈的敘述，何者錯誤？
A. 氧分子（O2）為電子最終的接受者
B. NADH的氧化發生於complex I
C. Coenzyme Q（CoQ）可協助將電子由complex I傳遞至complex II
D. Cytochrome c（Cyt c）可協助將電子由complex III傳遞至complex IV

正確答案：C. Coenzyme Q（CoQ）可協助將電子由complex I傳遞至complex II